Fluent in English.

The above is a clinical trial inclusion criterion. Annotated with entity spans:
[Non-query-able: Fluent in English.]